Clinical trial inclusion criterion:
Being treated for hypercholesterolemia Being treated for hypertension Being treated for diabetes mellitus Being treated for peripheral vascular disease

Annotated entities:
- Condition: "hypercholesterolemia"
- Procedure: "treated for hypercholesterolemia"
- Procedure: "treated for hypertension"
- Condition: "hypertension"
- Condition: "diabetes mellitus"
- Procedure: "treated for diabetes mellitus"
- Procedure: "treated for peripheral vascular disease"
- Condition: "peripheral vascular disease"